Clinical trial inclusion criterion:
not taking medications other than oral contraceptives

Annotated entities:
- Negation: "not"
- Drug: "medications"
- Negation: "other than"
- Drug: "oral contraceptives"